Clinical trial inclusion criterion:
All patients must be prohibited donation during the treatment process and in 28 days after treatment;

Entity relations:
- Has_index("during the treatment process", "treatment")
- Has_index("in 28 days after treatmen", "treatment")
- Has_negation("donation", "prohibited")
- Has_temporal("donation", "during the treatment process")
- Has_temporal("donation", "in 28 days after treatmen")